一位 21 歲女病人因未有初經求診，身高正常，但乳房發育不良且無腋毛及陰毛，內診可見陰道及子 宮頸發育完全。此外，病人亦抱怨嗅覺異常，關於此病人，下列敘述何者錯誤？
A. 血中 FSH、LH 及 E2最有可能呈現 hypergonadotropic hypogonadism
B. 可能合併子宮發育不良
C. 可能合併唇顎裂及聽覺障礙
D. 若病人尚無生育考量，可補充女性荷爾蒙及黃體素

正確答案：A. 血中 FSH、LH 及 E2最有可能呈現 hypergonadotropic hypogonadism